下列有關特發性肺纖維化（idiopathic pulmonary fibrosis）的病理變化的敘述，何者錯誤？
A. 非特異性間質肺炎（non-specific interstitial pneumonia）
B. 區塊狀間質纖維化（patchy interstitial fibrosis）
C. 纖維母細胞增生病灶（fibroblastic focus）
D. 蜂巢狀纖維化（honeycomb fibrosis）

正確答案：A. 非特異性間質肺炎（non-specific interstitial pneumonia）